Clinical trial exclusion criterion:
Known to have active viral hepatitis (B or C)

Annotated entities:
- Condition: "viral hepatitis"
- Qualifier: "active"
- Qualifier: "B"
- Qualifier: "C"